Clinical trial exclusion criterion:
Previous serious adverse event or hypersensitivity to cannabis or cannabinoids

Annotated entities:
- Condition: "hypersensitivity"
- Drug: "cannabis"
- Drug: "cannabinoids"
- Condition: "adverse event"
- Qualifier: "serious"